根據Catterall的研究認為，兒童的股骨頭部缺血性壞死症（Legg- Calvé -Perthes disease）預後不好的徵象中，下列何者除外？
A. 在股骨頭部的外側X光通過性增加（radiolucency in lateral femoral head）
B. 股骨頭部的生長板呈水平向（horizontal growth plate）
C. 發病時的年紀較輕（小於5歲）
D. 股骨頭部的壞死範圍達80%

正確答案：C. 發病時的年紀較輕（小於5歲）